Clinical trial exclusion criterion:
Congenital Cyanotic heart disease

Entity relations:
- Has_qualifier("Cyanotic heart disease", "Congenital")